Which human syndromes have been detected with Fluorescence in situ hybridization (FISH)?

The human syndromes which can be detected with FISH are:
1) Myelodysplastic Syndrome (MDS)
2) Genetic syndromes caused by somatic chromosomal mosaicism
3) Prader Willi syndrome (PWS)
4) Angelman syndrome (AS)
5) Williams syndrome
6) Smith Magenis syndrome 
7) Velocardiofacial syndrome
8) Jacobsen syndrome
9) Shwachman-Diamond syndrome
10) Saethre-Chotzen syndrome 
11) DiGeorge syndrome (DGS) 
12) Velo-cardio-facial syndrome (VCFS)
13) Miller-Dieker syndrome
14) Deletion 22q11.2 syndrome (D22S)